產後哺乳婦女比較不易受孕，主要是因那一種荷爾蒙的影響？
A. 動情素（estrogen）
B. 甲狀腺素（thyroxine）
C. 助孕酮（progesterone）
D. 泌乳素（prolactin）

正確答案：D. 泌乳素（prolactin）